Clinical trial exclusion criteria:
Contraindication of CT Known allergy to iodinated contrast media or history of contrast-induced nephropathy Decreased renal function: elevated serum creatinine(>1.5mg/dl) Contraindication to beta-blockers Severe arrhythmia: arterial fibrillation or uncontrolled tachyarrhythmia, or advanced atrioventricular block (second or third degree heart block)
Contraindication of MRI Claustrophobia Metallic hazards Pacemaker implant eGFR<30 ml/min
Unstable or uncooperative patients
Limited life expectancy due to cancer or end-stage renal or liver disease
Evidence of severe symptomatic heart failure (NYHA Class III or IV)
Previous myocardial infarction, coronary artery intervention, coronary artery bypass surgery, or other cardiac surgery

Annotated entities:
- Condition: "Contraindication of CT"
- Condition: "Known allergy"
- Drug: "iodinated contrast media"
- Condition: "contrast-induced nephropathy"
- Measurement: "renal function"
- Value: "Decreased"
- Value: "elevated"
- Measurement: "serum creatinine"
- Value: ">1.5mg/dl"
- Drug: "beta-blockers"
- Condition: "Contraindication"
- Condition: "arrhythmia"
- Qualifier: "Severe"
- Condition: "arterial fibrillation"
- Condition: "uncontrolled tachyarrhythmia"
- Condition: "advanced atrioventricular block"
- Condition: "third degree heart block"
- Condition: "second degree heart block"
- Line: "Contraindication of CT"
- Line: "Known allergy to iodinated contrast media or history of contrast-induced nephropathy"
- Line: "Decreased renal function: elevated serum creatinine(>1.5mg/dl)"
- Line: "Contraindication to beta-blockers"
- Line: "Severe arrhythmia: arterial fibrillation or uncontrolled tachyarrhythmia, or advanced atrioventricular block (second or third degree heart block)"
- Condition: "Contraindication"
- Procedure: "MRI"
- Condition: "Claustrophobia"
- Condition: "Metallic hazards"
- Device: "Pacemaker implant"
- Measurement: "eGFR"
- Value: "<30 ml/min"
- Condition: "uncooperative patients"
- Condition: "Unstable patients"
- Person: "life expectancy"
- Value: "Limited"
- Condition: "cancer"
- Condition: "end-stage renal disease"
- Condition: "liver disease"
- Qualifier: "severe"
- Qualifier: "symptomatic"
- Condition: "heart failure"
- Measurement: "NYHA"
- Value: "Class III or IV"
- Condition: "myocardial infarction"
- Temporal: "Previous"
- Procedure: "coronary artery intervention"
- Procedure: "coronary artery bypass surgery"
- Procedure: "other cardiac surgery"